La turbidimetría y la nefelometría son técnicas no espectroscópicas basadas en la dispersión de la luz, con interesantes aplicaciones en el análisis bioquímico. Los criterios a tener en cuenta para elegir entre nefelometría y turbidimetría en el análisis de una muestra que contiene partículas en suspensión son:
1. El tamaño de las partículas suspendidas y el detector del instrumento.
2. El tamaño de las partículas suspendidas y la longitud de onda de la radiación empleada.
3. La longitud de onda de la radiación emitida y la forma de las partículas suspendidas.
4. El tamaño de las partículas suspendidas y el color de las mismas.
5. El color de las partículas y su fluorescencia.

Respuesta correcta: 2. El tamaño de las partículas suspendidas y la longitud de onda de la radiación empleada.